Clinical trial exclusion criterion:
An initial plasma sodium concentration of higher than 150 mmol/L

Annotated entities:
- Multiplier: "initial"
- Measurement: "plasma sodium concentration"
- Value: "higher than 150 mmol/L"